Clinical trial exclusion criterion:
HCV, HIV, HDV coinfection.

Entity relations:
- OR("HCV coinfection", "coinfection HIV", "HDV coinfection")